Prior treatment with topotecan or gemcitabine.

The above is a clinical trial exclusion criterion. Annotated with entity spans:
[Temporal: Prior] [Observation: treatment] with [Drug: topotecan] or [Drug: gemcitabine].